Clinical trial inclusion criterion:
Serum creatinine >2.5 mg/dL within 7 days of index procedure

Annotated entities:
- Measurement: "Serum creatinine"
- Value: ">2.5 mg/dL"
- Temporal: "within 7 days of index procedure"
- Reference_point: "index procedure"